Clinical trial inclusion criterion:
Scheduled to undergo bilateral palatine tonsillectomy as the only procedure

Annotated entities:
- Mood: "Scheduled to undergo"
- Qualifier: "bilateral"
- Procedure: "palatine tonsillectomy"
- Multiplier: "only procedure"
- Procedure: "procedure"